Clinical trial exclusion criterion:
Without phone

Annotated entities:
- Observation: "phone"
- Negation: "Without"